Progesterone (P4) serum level at the HCG triggering day <= 1.5 ng/mL (Day O/Randomization)

The above is a clinical trial inclusion criterion. Annotated with entity spans:
[Measurement: Progesterone (P4) serum level] [Temporal: at the HCG triggering day] [Value: <= 1.5 ng/mL] ([Reference_point: Day O/Randomization])